2. Is being admitted to a hospital for routine vEEG monitoring related to seizures.

The above is a clinical trial inclusion criterion. Annotated with entity spans:
[Parsing_Error: 2.] Is being [Procedure: admitted to a hospital] for routine [Procedure: vEEG monitoring] related to [Condition: seizures].